2. One cycle of intermittent therapy up to a maximum exposure of 10 months.

The above is a clinical trial inclusion criterion. Annotated with entity spans:
2. [Multiplier: One cycle] of [Procedure: intermittent therapy] up to a [Measurement: maximum exposure] of [Value: 10 months].